某癌症病人手術後本來還算穩定，但卻疑似因為護理人員打錯了藥物，導致病人死亡，如果你是主治醫師，最不宜採取下列那一項措施？
A. 向病人安全委員會通報
B. 通知護理部進行根本原因分析
C. 妥善跟病人家屬解釋及溝通
D. 為保護護理同仁協助掩蓋真相

正確答案：D. 為保護護理同仁協助掩蓋真相